Clinical trial exclusion criterion:
History of malignancy of any organ system (other than localized basal cell carcinoma of the skin), treated or untreated, within the past 5 years, regardless of whether there is evidence of local recurrence or metastases.

Annotated entities:
- Temporal: "History"
- Condition: "malignancy"
- Qualifier: "any organ system"
- Negation: "other than"
- Condition: "localized basal cell carcinoma of the skin"
- Qualifier: "treated"
- Qualifier: "untreated"
- Temporal: "within the past 5 years"
- Non-representable: "regardless of whether there is evidence of local recurrence or metastases"